關於皮膚移植（skin graft）的敘述，下列何者正確?
A. 血漿浸潤（plasmatic circulation）是指在術後的72小時後，移植的皮膚（grafted skin）將直接吸收養分
B. 屍皮（cadaveric skin）覆蓋是屬於異種（xenograft）移植
C. 常見的手術失敗原因包括血腫、感染，但移植皮膚因位移產生缺失（loss）情況並不多見
D. 移植皮膚的真皮愈厚，愈不會產生傷口疤痕攣縮（scar contracture）

正確答案：D. 移植皮膚的真皮愈厚，愈不會產生傷口疤痕攣縮（scar contracture）